下列何者不是家族性膽固醇過高症之臨床表現？
A. 膽固醇過高
B. 三酸甘油酯過高
C. 嚴重動脈硬化
D. 黃色瘤（xanthomas）

正確答案：B. 三酸甘油酯過高